下列何者不是腫瘤瓦解症候群（tumor lysis syndrome）之實驗室發現？
A. 血鈣過高
B. 血鉀過高
C. 血尿酸過高
D. 血磷酸過高

正確答案：A. 血鈣過高